lack of co-operation, e.g. inability to use a PCA (patient controlled analgesia)-device

The above is a clinical trial exclusion criterion. Annotated with entity spans:
[Observation: lack of co-operation], e.g. [Condition: inability to use] a [Device: PCA] (patient controlled analgesia)-device